Clinical trial exclusion criterion:
Multiple gestations

Annotated entities:
- Observation: "Multiple gestations"